有關「血清CA19-9值」於胰臟癌（pancreatic ductal adenocarcinoma）診療上的敘述，何者正確？
A. 「血清CA19-9值的升高」是診斷胰臟癌的必要條件
B. 「血清CA19-9值的升高」建議使用於胰臟癌的篩檢（screening）
C. 「手術前血清中CA19-9值」與病患胰臟癌的期別（stage）具相關性
D. 「手術後血清中CA19-9值」與病患的預後無關

正確答案：C. 「手術前血清中CA19-9值」與病患胰臟癌的期別（stage）具相關性